Clinical trial exclusion criterion:
Hypertension (currently taking anti-hypertensive medications or resting blood pressure >140/90 mmHg)

Annotated entities:
- Condition: "Hypertension"
- Drug: "anti-hypertensive medications"
- Measurement: "resting blood pressure"
- Value: ">140/90 mmHg"